What is the target of Sutimlimab?

Sutimlimab is a novel humanized monoclonal antibody directed against classical pathway complement factor C1s.